一位35歲不孕男性病患，精液檢查發現無精蟲，血中FSH、LH及testosterone較低，且病人嗅覺異常，最可能 之診斷為：
A. hyperprolactinemia
B. Kallmann syndrome
C. Klinefelter's syndrome
D. XYY syndrome

正確答案：B. Kallmann syndrome